Clinical trial exclusion criterion:
a disease that might affect hepatic or renal function, contraindications to opioid analgesics, fetal growth retardation, signs of fetal asphyxia by cardiotocography, meconium stained amniotic fluid or placental insufficiency. The subjects should not have received fentanyl during the previous 14 days.

Annotated entities:
- Condition: "disease"
- Qualifier: "affect hepatic function"
- Qualifier: "affect renal function"
- Condition: "contraindications"
- Drug: "opioid analgesics"
- Condition: "fetal growth retardation"
- Condition: "fetal asphyxia"
- Mood: "signs of"
- Procedure: "cardiotocography"
- Condition: "meconium stained amniotic fluid"
- Condition: "placental insufficiency"
- Drug: "fentanyl"
- Negation: "not"
- Temporal: "during the previous 14 days"